關於妊娠糖尿病（gestational diabetes）的敘述，下列何者錯誤？
A. 除了胰島素（insulin）之外，口服降血糖藥物metformin及glyburide在懷孕中也可以使用
B. 妊娠糖尿病對母親的影響包括較容易高血壓及較高的剖腹產率
C. 妊娠糖尿病對胎兒的影響包括較容易發生巨嬰及新生兒高血糖
D. 針對妊娠糖尿病高危險族群（例如肥胖，家族糖尿病史等），應於第一次產檢就進行妊娠糖尿病的篩檢

正確答案：C. 妊娠糖尿病對胎兒的影響包括較容易發生巨嬰及新生兒高血糖